Clinical trial inclusion criterion:
Minimal use of chlorhexidine bathing*

Annotated entities:
- Procedure: "chlorhexidine bathing"
- Drug: "chlorhexidine"
- Multiplier: "Minimal use"